Donation or loss of 400 mL or more of blood within 8 weeks prior to dosing.

The above is a clinical trial exclusion criterion. Annotated with entity spans:
[Procedure: Donation] or [Condition: loss] of [Value: 400 mL or more] of blood [Temporal: within 8 weeks prior] to dosing.